Clinical trial exclusion criterion:
currently taking antimalarial medicines

Annotated entities:
- Drug: "antimalarial medicines"